Colonoscopy

The above is a clinical trial inclusion criterion. Annotated with entity spans:
[Procedure: Colonoscopy]